兒童威爾氏腫瘤（Wilm's tumor）最容易發生轉移的是下列何種器官？
A. 腦部
B. 肺臟
C. 膀胱
D. 骨骼

正確答案：B. 肺臟